Clinical trial exclusion criterion:
Presence of a cardiac pacemaker or stimulator

Entity relations:
- OR("cardiac pacemaker", "cardiac stimulator")